剛出生之男嬰首次餵食即發生嘔吐，接著幾次餵食又發生嘔吐，且嘔吐物中有膽汁。理學檢查顯示男嬰腹部略凹，且無腸蠕動音，腹部 X 光攝影顯示近端小腸有腸氣但末端消化道則腸氣很少。引起該男嬰嘔吐等臨床表現，最可能的原因是：
A. 胃竇有隔膜（antral web）
B. 膽管囊腫
C. 巨腸症
D. 腸絞轉（volvulus）

正確答案：D. 腸絞轉（volvulus）